Patients with body weight = 55 kg and = 140 kg and body mass index (BMI) = 18 kg/m2

The above is a clinical trial inclusion criterion. Annotated with entity spans:
Patients with [Measurement: body weight] [Value: = 55 kg and = 140 kg] and [Measurement: body mass index (BMI)] [Value: = 18 kg/m2]